急性篩竇炎所引起的頭痛，通常位於那一部位？
A. 枕骨部
B. 眼球深部
C. 牙齒
D. 顳骨部

正確答案：B. 眼球深部